關於自身免疫性胃炎（autoimmune gastritis）何者錯誤？
A. 針對壁細胞和內在因子的自體抗體（antibodies to parietal cells & intrinsic factor）可在血清及胃液中測得
B. 維生素B12缺乏（vitamin B12 deficiency）
C. 胃酸分泌不足，胃泌素（gastrin）分泌增加
D. 胃竇（antrum）內分泌細胞減少

正確答案：D. 胃竇（antrum）內分泌細胞減少